known hypersensitivity or contraindication to the study drugs

The above is a clinical trial exclusion criterion. Annotated with entity spans:
known [Condition: hypersensitivity] or [Condition: contraindication] to the [Drug: study drugs]